脊椎動物中，由下列那種酶負責合成 18S 與 28S rRNA？
A. RNA polymerase I
B. RNA polymerase II
C. RNA polymerase III
D. Ribosomal RNase

正確答案：A. RNA polymerase I